Which company sells the drug Afrezza since 2015?

Afrezza has been marketed by Sanofi since February 2015.